6. Are not currently taking melatonin.

The above is a clinical trial inclusion criterion. Annotated with entity spans:
6. Are [Negation: not] [Temporal: currently] taking [Drug: melatonin].